Clinical trial exclusion criterion:
Asthma and allergy to aspirin, ibuprofen or any other nonsteroidal antiinflammatory drug;

Annotated entities:
- Condition: "Asthma"
- Condition: "allergy"
- Drug: "aspirin"
- Drug: "ibuprofen"
- Drug: "nonsteroidal antiinflammatory drug"
- Qualifier: "any other"